La evaluación de un programa de salud debe considerar:
1. La necesidad del programa.
2. Los resultados conseguidos.
3. El rendimiento de los recursos.
4. El cumplimiento de los tiempos previstos.
5. Todas las respuestas anteriores son correctas.

Respuesta correcta: 5. Todas las respuestas anteriores son correctas.